Clinical trial inclusion criterion:
Can be previously treated with Depo-Lupron, Depo-Provera, or Oral Contraceptive pills

Entity relations:
- Has_temporal("treated", "previously")
- AND("treated", "Depo-Lupron")
- OR("Depo-Lupron", "Depo-Provera", "Oral Contraceptive pills")